Clinical trial inclusion criterion:
6. patient considered surgery but decided to wait and/or refused surgery -

Annotated entities:
- Procedure: "surgery"
- Parsing_Error: "patient considered surgery but decided to wait and/or refused surgery -"